Subjects were to have a negative urine screen for alcohol, drugs of abuse (screening only), and cotinine.

The above is a clinical trial inclusion criterion. Annotated with entity spans:
Subjects were to have a [Value: negative] [Measurement: urine screen for alcohol], drugs of abuse (screening only), and cotinine.